Clinical trial exclusion criterion:
Poor glucose control (HbA1C>10 %)

Entity relations:
- Has_value("HbA1C", ">10 %")
- Subsumes("Poor glucose control", "HbA1C")